submucosal,

The above is a clinical trial inclusion criterion. Annotated with entity spans:
[Condition: submucosal],